Clinical trial inclusion criterion:
Acute kidney injury, defined as increase in S-creatinine 50% or 27 mol/L

Entity relations:
- Has_value("increase in S-creatinine", "50% or 27 mol/L")